Clinical trial exclusion criterion:
Subjects with severe kidney disease

Entity relations:
- Has_qualifier("kidney disease", "severe")